No acute diverticulitis episode in the last 3 months

The above is a clinical trial inclusion criterion. Annotated with entity spans:
No [Qualifier: acute] [Condition: diverticulitis] episode [Temporal: in the last 3 months]